Clinical trial exclusion criterion:
Patients with known bleeding/clotting disorders

Entity relations:
- OR("clotting disorders", "disorders bleeding")